Greater than 4 months out from C-spine injury

The above is a clinical trial inclusion criterion. Annotated with entity spans:
[Temporal: Greater than 4 month]s out from [Condition: C-spine injury]